關於臉部縫合技巧與如何減少疤痕增生之敘述，下列何者錯誤？
A. 臉部皮膚之切口（incision）須經詳細計畫與設計，不可任意切割傷口
B. 臉部皮膚之切口須與皮膚鬆弛線（relax skin tension line）儘量平行
C. 臉部皮膚之切口須儘量與皺紋方向垂直切開
D. 臉部傷口之縫合需消除皮下死腔（dead space），使用較細之縫線縫合傷口

正確答案：C. 臉部皮膚之切口須儘量與皺紋方向垂直切開